Which RNA polymerase transcribes enhancer RNAs?

Enhancer RNAs (eRNAs) are a group of lncRNAs transcribed from enhancers by RNA Polymerase II.